陳小姐最近被診斷患有全身性紅斑狼瘡（SLE）合併有腎炎，醫師建議腎臟切片檢查。陳小姐拒絕進行切片檢查，同時要求不要將其病情告知其未婚夫（擔心影響彼此的婚約）。陳小姐的未婚夫相當關心陳小姐的病情，親自前來詢問，醫師是否應該將陳小姐的病情告知其未婚夫？
A. 不應該，因為未婚夫並非家屬，醫師不應該將陳小姐的病情對其告知
B. 不應該，因為陳小姐已經明白表示不要將病情告知其未婚夫，醫師應該尊重其決定
C. 應該，因為未婚夫雖非家屬，但為其關係人，醫師應該將陳小姐的病情對其告知
D. 應該，因為陳小姐雖然口頭表示不要將病情告知其未婚夫，但在陳小姐未以書面敘明其反對意願前，醫師應該將陳小姐的病情告知其未婚夫

正確答案：B. 不應該，因為陳小姐已經明白表示不要將病情告知其未婚夫，醫師應該尊重其決定